What kind of approaches you need to combine in order to manage Familial spontaneous pneumothorax?

Clinical, radiological and genetic approaches